Clinical trial exclusion criterion:
major illness or congenital anomaly

Entity relations:
- OR("major illness", "congenital anomaly")